Clinical trial exclusion criterion:
Previous sub-urethral sling

Annotated entities:
- Procedure: "sub-urethral sling"
- Temporal: "Previous"